下列關於鼻病毒（Rhinoviruses）之敘述，何者為錯？
A. 為 RNA 病毒
B. 其蛋白殼（capsid）在酸性環境中穩定
C. 在 33℃下生長良好，與其喜好在鼻黏膜複製有關
D. 大多數以 ICAM-1（intracellular adhesion molecule-1）為進入細胞之受器（receptor）

正確答案：B. 其蛋白殼（capsid）在酸性環境中穩定